Clinical trial exclusion criterion:
Allergy to any of the drugs used in the study

Entity relations:
- AND("Allergy", "drugs used in the study")